下列那一種感染原是屬於"obligate intracellular bacteria"？
A. Chlamydia trachomatis
B. Treponema pallidum
C. Clostridium botulinum
D. Pseudomonas aeruginosa

正確答案：A. Chlamydia trachomatis